Clinical trial inclusion criterion:
Scheduled for invasive coronary angiography

Annotated entities:
- Procedure: "invasive coronary angiography"
- Mood: "Scheduled"